下列關於脂肪酸的敘述，何者正確？
A. 血液中荷爾蒙 glucagon 可以促進細胞中脂肪酸的生合成
B. 細胞中脂肪酸的生合成過程中需要 NADPH 做為電子攜帶者（electron carrier）
C. 細胞中脂肪酸的生合成中間產物 malonyl-CoA 會活化粒線體外膜上酵素（carnitine acyltransferase Ⅰ）
D. 胰島素（insulin）可以增加血液中脂肪酸的濃度

正確答案：B. 細胞中脂肪酸的生合成過程中需要 NADPH 做為電子攜帶者（electron carrier）